Clinical trial inclusion criterion:
Patients aged at least 18 years

Entity relations:
- Has_value("aged", "at least 18 years")